Medical or anatomic contraindication to supraclavicular blockade as judged by clinician

The above is a clinical trial exclusion criterion. Annotated with entity spans:
[Qualifier: Medical] or [Qualifier: anatomic] [Condition: contraindication] to [Procedure: supraclavicular blockade] [Non-representable: as judged by clinician]